The formation of which inflammatory molecule is regulated by MAP3K8 (TPL2)?

MAP3K8 (Tpl2) regulates the formation of IL-1β by masking its inflammatory function.